patients aged >18, <75, left ventricle ejection fraction (LVEF) >50%, multivessel coronary disease detected by coronarography, indication to receive a CABG, stable CAD. All diabetics and non diabetics.

The above is a clinical trial inclusion criterion. Annotated with entity spans:
patients [Person: aged] [Value: >18, <75], [Measurement: left ventricle ejection fraction] ([Measurement: LVEF]) [Value: >50%], [Condition: multivessel coronary disease] detected by [Procedure: coronarography], [Mood: indication to receive] a [Procedure: CABG], [Qualifier: stable] [Condition: CAD]. All [Condition: diabetics] and [Condition: non diabetics].